Patient unwilling to accept a pump

The above is a clinical trial exclusion criterion. Annotated with entity spans:
Patient [Mood: unwilling to accept] a [Device: pump]